有關多發性骨髓瘤（multiple myeloma）的敘述，下列何者錯誤？
A. 病理組織下可發現惡性漿細胞（plasma cell）
B. X光檢查在頭骨及骨盆可發現多發性鑿孔狀（punched out）骨破壞病灶
C. 可用骨骼同位素掃描（bone scan）來診斷是否為單一或多發的骨骼侵犯
D. 已有幹細胞移植成功治療病患的病例

正確答案：C. 可用骨骼同位素掃描（bone scan）來診斷是否為單一或多發的骨骼侵犯